Clinical trial inclusion criterion:
2. Is being admitted to a hospital for routine vEEG monitoring related to seizures.

Entity relations:
- AND("vEEG monitoring", "seizures")
- AND("admitted to a hospital", "vEEG monitoring")